Contraindication to adenosine stress test

The above is a clinical trial exclusion criterion. Annotated with entity spans:
[Condition: Contraindication] to [Procedure: adenosine stress test]